El conjunto de medios y sistemas que facilitan el contacto del agente infeccioso con el sujeto receptor, se corresponde con:
1. Fuente de infección.
2. Hábitat.
3. Mecanismo de transmisión.
4. Biotopo.
5. Reservorio.

Respuesta correcta: 3. Mecanismo de transmisión.